GCS less than 15

The above is a clinical trial exclusion criterion. Annotated with entity spans:
[Measurement: GCS] [Value: less than 15]